Clinical trial exclusion criterion:
Patients with hepatic impairment (child-Pugh staging, calibration = 5) or renal impairment (creatinine clearance = 30ml / min), recent peptic ulcer, a history of hypersensitivity to cilostazol, cancer patients undergoing treatment.

Annotated entities:
- Condition: "hepatic impairment"
- Measurement: "child-Pugh staging"
- Value: "calibration = 5"
- Condition: "renal impairment"
- Measurement: "creatinine clearance"
- Value: "= 30ml / min"
- Temporal: "recent"
- Condition: "peptic ulcer"
- Temporal: "history of"
- Condition: "hypersensitivity"
- Drug: "cilostazol"
- Condition: "cancer"
- Procedure: "treatment"